History of cardiogenic shock

The above is a clinical trial exclusion criterion. Annotated with entity spans:
[Temporal: History] of [Condition: cardiogenic shock]